在局部麻醉劑（local anesthetics）中，添加血管收縮劑（vasoconstrictors）的作用及機制，下列何者錯誤？
A. 加快局部麻醉劑開始作用（onset）的時間
B. 減緩局部麻醉劑的吸收速度
C. 加強局部麻醉劑止痛的品質
D. 減少局部麻醉劑毒性副作用

正確答案：A. 加快局部麻醉劑開始作用（onset）的時間